Which interleukin receptors are targeted with rilonacept?

Rilonacept inhibits interleukin-1α and interleukin-1β. It has a role for treatment of pericarditis.